Clinical trial exclusion criterion:
An active or any history of neurological disorder, including but not limited to seizure disorder, epilepsy, stroke, neurological disease, cognitive impairment, head trauma with prolonged loss of consciousness (>10 minutes), or migraine headaches;

Entity relations:
- Has_qualifier("neurological disorder", "active")
- Has_qualifier("prolonged loss of consciousness", ">10 minutes")
- AND("head trauma", "prolonged loss of consciousness")
- Subsumes("neurological disorder", "seizure disorder")
- OR("active", "history")
- OR("seizure disorder", "epilepsy", "stroke", "neurological disease", "cognitive impairment", "head trauma", "migraine headaches")